10個月大的男嬰發燒和皮疹已2天。過去健康狀況良好，家人沒有生病。此男嬰精神好，身體診察發現口腔黏膜有潰瘍，頭皮、臉部、耳朵和軀幹有水泡，部分水泡中央凹陷呈肚臍狀。最可能的診斷是：
A. 手足口症（Hand-foot-and-mouth disease）
B. 猩紅熱（Scarlet fever）
C. 水痘（Varicella）
D. 麻疹（Measles）

正確答案：C. 水痘（Varicella）